The patients have allergic history or contraindication of tamoxifen.

The above is a clinical trial exclusion criterion. Annotated with entity spans:
The patients have [Condition: allergic] history or [Condition: contraindication] of [Drug: tamoxifen].